Histological diagnosis of high grade glandular epithelial neoplasia (Vienna 4-1 to 4-46), possibly multifocal or stage 0 (Tis, N0, M0),

The above is a clinical trial inclusion criterion. Annotated with entity spans:
[Procedure: Histological diagnosis] of [Qualifier: high grade] [Condition: glandular epithelial neoplasia] ([Measurement: Vienna] [Value: 4-1 to 4-46]), possibly [Qualifier: multifocal] or [Measurement: stage] [Value: 0] ([Measurement: T][Value: is], [Measurement: N][Value: 0], [Measurement: M][Value: 0]),